People with any type of implantable device

The above is a clinical trial exclusion criterion. Annotated with entity spans:
People with any type of [Device: implantable device]